Clinical trial exclusion criterion:
Current HAART use for HIV, long term use of immunosuppressants (e.g. steroids, chemotherapy, TNF-inhibitors and related agents)

Annotated entities:
- Procedure: "HAART"
- Condition: "HIV"
- Multiplier: "long term use"
- Drug: "immunosuppressants"
- Drug: "steroids"
- Drug: "chemotherapy"
- Drug: "TNF-inhibitors"